Written consent for participation in the clinical trial

The above is a clinical trial inclusion criterion. Annotated with entity spans:
[Informed_consent: Written consent for participation in the clinical trial]